Si una muestra presenta un coeficiente de variación (CV) de 0,15 significa que:
1. La desviación típica supone el 15% de la media.
2. La media supone el 25% de la desviación típica.
3. La media supone el 30% de la varianza.
4. La desviación típica supone el 85% de la media.

Respuesta correcta: 1. La desviación típica supone el 15% de la media.